What is the 3D genome browser?

The 3D Genome Browser, http://3dgenome.org, allows users to conveniently explore both their own and over 300 publicly available chromatin interaction data of different types. The browser provides multiple methods linking distal cis-regulatory elements with their potential target genes. Users can seamlessly integrate thousands of other omics data to gain a comprehensive view of both regulatory landscape and 3D genome structure.